Clinical trial inclusion criterion:
Quality or expressibility score =20 years old: >1 or >20 years old: =1

Annotated entities:
- Measurement: "score Quality"
- Measurement: "expressibility score"
- Non-representable: "Quality or expressibility score =20 years old: >1 or >20 years old: =1"